下列何者形成肛門直腸屈曲（anorectal flexure）且有助於排便控制（fecal continence）？
A. 肛門內括約肌（internal anal sphincter）
B. 尾骨肌（coccygeus）
C. 恥骨直腸肌（puborectalis）
D. 肛門外括約肌（external anal sphincter）

正確答案：C. 恥骨直腸肌（puborectalis）